Clinical trial inclusion criteria:
Males and females of 18 years of age or older at the time of the vaccination
Severe chronic kidney disease (Stage 4 and 5)

Annotated entities:
- Person: "Males"
- Person: "females"
- Value: "18 years or older"
- Person: "age"
- Temporal: "at the time of the vaccination"
- Reference_point: "vaccination"
- Procedure: "vaccination"
- Grammar_Error: "and"
- Condition: "chronic kidney disease"
- Qualifier: "Severe"
- Condition: "Stage 4 chronic kidney disease"
- Condition: "Stage 5 chronic kidney disease"
- Grammar_Error: "and"